Clinical trial inclusion criterion:
Hepatic function, as follows: Aspartate aminotransferase (AST) <=3 x ULN, Alanine aminotransferase (ALT) <=3 x ULN, Total Bilirubin <=1.5 x ULN.

Annotated entities:
- Measurement: "spartate aminotransferase (AST)"
- Value: "<=3 x ULN"
- Measurement: "Alanine aminotransferase (ALT)"
- Value: "<=3 x ULN"
- Measurement: "Total Bilirubin"
- Value: "<=1.5 x ULN"